Which factors play a role in promoter proximal pausing of RNA polymerase II?

NELF (negative elongator factor) and DSIF (DRB Sensitivity Inducing Factor)